Clinical trial exclusion criterion:
16. Men who are unwilling to use contraception if their partners are of childbearing potential

Annotated entities:
- Person: "Men"
- Mood: "unwilling"
- Drug: "contraception"
- Observation: "their partners are of childbearing potential"
- Non-representable: "their partners are of childbearing potential"